Clinical trial exclusion criterion:
inability to understand the informed consent and demands of the study;

Annotated entities:
- Informed_consent: "inability to understand the informed consent and demands of the study;"